Clinical trial exclusion criterion:
concomitant disease which must be treated with antibiotics

Annotated entities:
- Temporal: "concomitant"
- Condition: "disease"
- Drug: "antibiotics"
- Procedure: "treated"